Hemoglobin (hgb) greater than or equal to 10 g/dL without transfusional support or growth factor use in the 4 weeks before study randomization

The above is a clinical trial inclusion criterion. Annotated with entity spans:
[Measurement: Hemoglobin] ([Measurement: hgb]) [Value: greater than] or [Value: equal to 10 g/dL] [Negation: without] [Observation: transfusional support] or [Observation: growth factor use] [Temporal: in the 4 weeks before study randomization]